一位70歲女性患者，有高血壓、糖尿病病史多年，清晨6點起床時皆正常，但盥洗時突然說話不太清楚，左側肢體無力，清晨6 點50分被家人送至急診室，血壓：180/98 mmHg，下述處理何者最不適合？
A. 詢問病史和簡易身體神經學檢查後，就應立即安排腦部電腦斷層檢查
B. 立即抽血進行血液生化和相關檢查，並做心電圖
C. 先給預防性降血壓藥，並安排加護中心病床
D. 若上述檢查皆正常，儘早給予血栓溶解劑 rt-PA

正確答案：C. 先給預防性降血壓藥，並安排加護中心病床